Las escalas Bayley de desarrollo infantil (BSID) se aplican:
1. Durante los primeros 2 años y medio de vida.
2. Desde los 4 hasta los 6 años.
3. Desde los 4 hasta los 10 años.
4. Desde el primer mes de vida hasta los 10 años.

Respuesta correcta: 1. Durante los primeros 2 años y medio de vida.